Clinical trial inclusion criteria:
HIV-1 infected males or females
over 18 years of age
signed informed consent
currently receiving a stable antiretroviral regimen comprising of:
two or more licensed NRTIs
one licensed NNRTI or boosted protease inhibitor
no previous protease inhibitor resistance documented on HIV-1 genotypic resistance testing
failure of current antiretroviral regimen due to:
toxicity, intolerance or virological failure if receiving an NNRTI containing regimen at screening
toxicity or intolerance if receiving a boosted-protease inhibitor regimen at screening (with plasma HIV RNA < 400 copies/mL at screening)
willing to modify antiretroviral therapy, in accordance with the randomisation assignment
no previous exposure to etravirine
subjects in good health upon medical history, physical exam, and laboratory testing in the opinion of the investigator
have no serologic evidence of active HBV infection evidenced by negative hepatitis B surface antigen
female subjects who are heterosexually active and of childbearing potential (i.e., not surgically sterile or at least two years post menopausal) must practice contraception as follows from screening through completion of the study:
barrier contraceptives (condom, diaphragm with spermicide)
IUD or Depo PLUS a barrier contraceptive
female subjects of childbearing potential must have a negative pregnancy test.

Annotated entities:
- Condition: "HIV-1 infected"
- Person: "males"
- Person: "females"
- Value: "over 18 years"
- Person: "age"
- Post-eligibility: "signed informed consent"
- Procedure: "antiretroviral regimen"
- Multiplier: "two or more"
- Drug: "NRTI"
- Qualifier: "licensed"
- Multiplier: "one"
- Qualifier: "licensed"
- Drug: "NNRTI"
- Drug: "boosted protease inhibitor"
- Drug: "protease inhibitor"
- Condition: "protease inhibitor resistance"
- Procedure: "HIV-1 genotypic resistance testing"
- Condition: "HIV-1"
- Condition: "HIV-1 genotypic resistance"
- Procedure: "antiretroviral regimen"
- Condition: "failure of current antiretroviral regimen"
- Temporal: "current"
- Condition: "toxicity"
- Condition: "intolerance"
- Condition: "virological failure"
- Drug: "NNRTI"
- Procedure: "NNRTI containing regimen"
- Temporal: "at screening"
- Condition: "toxicity"
- Condition: "intolerance"
- Procedure: "boosted-protease inhibitor regimen"
- Drug: "protease inhibitor"
- Temporal: "at screening"
- Measurement: "plasma HIV RNA"
- Value: "< 400 copies/mL"
- Temporal: "at screening"
- Procedure: "antiretroviral therapy"
- Observation: "willing"
- Drug: "etravirine"
- Negation: "no"
- Temporal: "previous"
- Condition: "good health"
- Temporal: "medical history"
- Procedure: "physical exam"
- Procedure: "laboratory testing"
- Condition: "serologic evidence of active HBV infection"
- Condition: "HBV infection"
- Measurement: "hepatitis B surface antigen"
- Value: "negative"
- Person: "female"
- Condition: "heterosexually active"
- Condition: "childbearing potential"
- Condition: "surgically sterile"
- Procedure: "surgically"
- Negation: "not"
- Temporal: "at least two years"
- Condition: "post menopausal"
- Procedure: "contraception"
- Pregnancy_considerations: "female subjects who are heterosexually active and of childbearing potential (i.e., not surgically sterile or at least two years post menopausal) must practice contraception as follows from screening through completion of the study:"
- Parsing_Error: "female subjects who are heterosexually active and of childbearing potential (i.e., not surgically sterile or at least two years post menopausal) must practice contraception as follows from screening through completion of the study:"
- Device: "barrier contraceptives"
- Device: "condom"
- Device: "diaphragm"
- Qualifier: "with spermicide"
- Device: "IUD"
- Device: "Depo"
- Device: "barrier contraceptive"
- Measurement: "pregnancy test"
- Value: "negative"
- Condition: "childbearing potential"
- Person: "female"